皮質醇（cortisol）對促進那一種血球數目增加的作用最強？
A. 嗜酸性球（eosinophils）
B. T細胞（T cells）
C. 淋巴球（lymphocytes）
D. 紅血球（RBC）

正確答案：D. 紅血球（RBC）